在心臟移植手術時，若受贈者術前的肺動脈壓非常高，因而造成術後死亡，最可能的死亡原因為：
A. 急性肺水腫
B. 急性右心衰竭
C. 急性排斥現象
D. 急性肺梗塞

正確答案：B. 急性右心衰竭